Clinical trial exclusion criterion:
Patients who undergo iliac crest bone graft harvesting as part of their surgery

Annotated entities:
- Procedure: "iliac crest bone graft harvesting"